Which mutations of alpha-myosin heavy chain gene are implicated in hypertrophic cardiomyopathy?

The following mutations of alpha-myosin heavy chain gene are implicated in hypertrophic cardiomyopathy: R403Q; Q1065H and Arg-249-->Gln